Clinical trial inclusion criterion:
moderate to severe Crohn's Disease (basic HBI = 7) with stenosis

Entity relations:
- Has_value("basic HBI", "= 7")
- Has_qualifier("Crohn's Disease", "moderate to severe")
- Subsumes("moderate to severe", "basic HBI")
- AND("Crohn's Disease", "stenosis")